Clinical trial exclusion criterion:
Subjects had a history of seizures, neuroleptic malignant syndrome, clinically significant tardive dyskinesia, or other medical condition that would expose them to undue risk or interfere with study assessments.

Entity relations:
- Has_qualifier("tardive dyskinesia", "clinically significant")
- Has_temporal("seizures", "history")
- OR("seizures", "neuroleptic malignant syndrome", "tardive dyskinesia")